有關小腸閉鎖（intestinal atresia）的病人，對於其可能發生的症狀，下列何者錯誤？
A. 腹部腫脹
B. 羊水過少
C. 有膽汁的嘔吐物
D. 稀疏的胎便

正確答案：B. 羊水過少